關於身體組織皮瓣移植用來作為乳癌病患手術的重建，下列何者錯誤？
A. 闊背肌皮瓣（latissimus dorsi）因為解剖位置相近的關係最常被使用
B. 闊背肌皮瓣可以合併義乳進行重建
C. 現今手術的技術成熟，大部分的病患可以在手術切除腫瘤，立即進行重建手術
D. 自體組織皮瓣因為供血的關係，可能有組織壞死（necrosis）的問題

正確答案：A. 闊背肌皮瓣（latissimus dorsi）因為解剖位置相近的關係最常被使用